Clinical trial inclusion criterion:
Tolerating tuberculosis therapy containing rifampin for the 2 weeks prior to screening,except for persons taking protease inhibitors at time of diagnosis of TB.,. Subjects taking protease inhibitors will be screened and initiate visit 1 within 3 days of starting TB medication

Entity relations:
- Has_index("for the 2 weeks prior to screening", "screening")
- AND("tuberculosis therapy", "rifampin")
- Has_temporal("tuberculosis therapy", "for the 2 weeks prior to screening")
- Has_index("at time of diagnosis of TB", "time of diagnosis of TB")
- Has_temporal("protease inhibitors", "at time of diagnosis of TB")
- Has_negation("protease inhibitors", "except")
- AND("tuberculosis therapy", "protease inhibitors")